Patients who are known to be pregnant or lactating;

The above is a clinical trial exclusion criterion. Annotated with entity spans:
[Pregnancy_considerations: Patients who are known to be pregnant or lactating];